下列何種心房中隔缺損（atrial septal defect）常合併局部肺靜脈回流異常（abnormal pulmonary venous drainage）？
A. 第二型（secundum defect）
B. 第一型（primum defect）
C. 冠狀靜脈竇型（coronary sinus defect）
D. 靜脈竇型（sinus venous defect）

正確答案：D. 靜脈竇型（sinus venous defect）